5-phosphoribosyl-1-pyrophosphate（PRPP）合成inosine 5'-monophosphate（IMP）的核苷酸生合成途徑中，PRPP amidotransferase反應速率可受到下列那一個產物的直接負調控？
A. AMP
B. CMP
C. FAD
D. malonyl-CoA

正確答案：A. AMP